Durante la consulta con una familia apunta los siguientes datos en la valoración: Pareja joven con hijo de 10 meses, que refieren falta de soporte familiar y de amigos, con historia de dilación en la toma de decisiones, falta de organización secuencial y expresión por parte de la madre de preocupación por las tareas que ha de realizar. Señale el diagnostico de enfermería que esta mujer está mostrando:
1. Planificación ineficaz de las actividades.
2. Afrontamiento familiar incapacitante.
3. Afrontamiento familiar comprometido.
4. Cansancio del rol de cuidador.

Respuesta correcta: 1. Planificación ineficaz de las actividades.